婦女發生大便失禁最有可能與下列何者有關？
A. 恥骨尾骨肌（pubococcygeus muscle）受損
B. 骨盆底肌與肛門括約肌神經支配受損
C. 會陰神經（pudendal nerve）受損
D. 閉孔肌（obturator muscle）受損

正確答案：B. 骨盆底肌與肛門括約肌神經支配受損